Clinical trial exclusion criterion:
Pediatric patients (under 18 years) Pregnancy Patients who are unresponsive at baseline, who have neurologic deficits at baseline, or who are allergic to dexmedetomidine

Annotated entities:
- Person: "Pediatric"
- Value: "under 18 years"
- Person: "years"
- Line: "Patients who are unresponsive at baseline, who have neurologic deficits at baseline, or who are allergic to dexmedetomidine"
- Line: "Pediatric patients (under 18 years)"
- Condition: "Pregnancy"
- Line: "Pregnancy"
- Observation: "unresponsive"
- Temporal: "at baseline"
- Condition: "neurologic deficits"
- Temporal: "at baseline"
- Condition: "allergic"
- Drug: "dexmedetomidine"